Clinical trial exclusion criterion:
Patients who do not speak English or Spanish

Annotated entities:
- Negation: "not"
- Observation: "speak English"
- Observation: "speak Spanish"